根據美國食品與藥物管理局（FDA）的分類，藥物使用於妊娠期證明對動物無害，但對於人類則尚無足夠之研究，此類藥物應歸類為：
A. Category A
B. Category B
C. Category C
D. Category D

正確答案：B. Category B